Clinical trial inclusion criterion:
ECOG Performance Status 0-1

Entity relations:
- Has_value("ECOG Performance Status", "0-1")